Participation in another clinical trial within previous 30 days and/or anticipated participation in another trial during this study.

The above is a clinical trial exclusion criterion. Annotated with entity spans:
[Post-eligibility: Participation in another clinical trial within previous 30 days and/or anticipated participation in another trial during this study.]